Wound manipulation

The above is a clinical trial exclusion criterion. Annotated with entity spans:
[Observation: Wound manipulation]